Clinical trial inclusion criterion:
Liver transplant recipients who are 18-65 years of age of a primary liver transplant

Annotated entities:
- Person: "Liver transplant recipients"
- Person: "age"
- Value: "18-65 years"
- Procedure: "primary liver transplant"